Patients with a history of prior pharmacogenomic testing;

The above is a clinical trial exclusion criterion. Annotated with entity spans:
[Competing_trial: Patients with a history of prior pharmacogenomic testing];